Patient who sign for single port gynecologic laparoscopic surgery or NOTE surgery

The above is a clinical trial exclusion criterion. Annotated with entity spans:
Patient who sign for [Qualifier: single port] [Procedure: gynecologic laparoscopic surgery] or [Procedure: NOTE surgery]